Severe hyperlipidemia or severe disorders of lipid metabolism characterized by hypertriglyceridemia (serum triglyceride concentration >1,000 g/dL).

The above is a clinical trial exclusion criterion. Annotated with entity spans:
[Qualifier: Severe] [Condition: hyperlipidemia] or [Qualifier: severe] [Condition: disorders of lipid metabolism] characterized by [Condition: hypertriglyceridemia] ([Measurement: serum triglyceride concentration] [Value: >1,000 g/dL]).